What is NTI, Nerve Tissue Contrast Index

The NTI is a ratio of average brightness levels of surrounding tissue and the median nerve used in the diagnostic of Carpal Tunnel Syndrome.